下列何者會增加肝臟肝醣分解（glycogenolysis）？
A. 抑制glycogen phosphorylase
B. 活化phosphorylase b kinase
C. 活化phosphorylase a phosphatase
D. 抑制glycogen synthase kinase 3（GSK3）

正確答案：B. 活化phosphorylase b kinase